Clinical trial inclusion criterion:
Hemoglobin A1c (HbA1c) = 9%

Annotated entities:
- Measurement: "Hemoglobin A1c (HbA1c)"
- Value: "= 9%"